Allergy to ceftriaxone or macrolides

The above is a clinical trial exclusion criterion. Annotated with entity spans:
[Condition: Allergy] to [Drug: ceftriaxone] or [Drug: macrolides]